Fasting plasma glucose > 7,0 mM, HbA1c > 48 mmol/mol 3 months after RYGB.

The above is a clinical trial exclusion criterion. Annotated with entity spans:
[Measurement: Fasting plasma glucose] [Value: > 7,0 mM], [Measurement: HbA1c] [Value: > 48 mmol/mol] [Temporal: 3 months after RYGB].